Clinical trial exclusion criterion:
Pregnancy, breast feeding or plan to be pregnant woman.

Entity relations:
- Has_mood("pregnant", "plan to be")
- OR("Pregnancy", "breast feeding", "pregnant")